40歲女性，過去身體健康，因為近二日來說話不清楚、吞嚥困難和兩眼皮無法全張開，症狀逐漸加劇，來急診就醫。來院前五日她和媽媽與先生三人吃了路邊攤購買的素食豆干後，開始出現腹瀉、嘔吐和腹痛，後續發生前述症狀，同時，病患也逐漸出現近端肢體、顏面肌肉和呼吸無力。來院當日，媽媽和先生也開始出現類似的病症。理學檢查發現病患意識清楚，沒有發燒，心跳和血壓正常，但是呼吸較淺且費力；神經學檢查發現深部肌腱反射（deep tendon reflex）降低。最有可能的診斷為何？
A. Guillain-Barré syndrome due to campylobacteriosis
B. tetanus
C. botulism
D. Lambert-Eaton syndrome

正確答案：C. botulism